在腎臟，下列何者不會出現在髓質錐體（medullary pyramid）？
A. 乳突管（papillary duct）
B. 腎小球（renal corpuscle）
C. 亨氏襻降肢（descending limb of Henle's loop）
D. 亨氏襻升肢（ascending limb of Henle's loop）

正確答案：B. 腎小球（renal corpuscle）